Clinical trial exclusion criteria:
NA

Annotated entities:
- Non-query-able: "NA"